Patients with placenta pathology such as praevia, acreta, pre-eclampsia

The above is a clinical trial exclusion criterion. Annotated with entity spans:
Patients with [Condition: placenta pathology] such as [Condition: praevia], [Condition: acreta], [Condition: pre-eclampsia]